Cuál de las afirmaciones siguientes sobre los esfingolípidos es CIERTA:
1. Pueden presentar carga, pero no son moléculas anfipáticas.
2. Están formados por glicerol y ácidos grasos.
3. Contienen dos ácidos grasos esterificados.
4. Los cerebrósidos y los ganglósidos son esfingolípidos.
5. Los terpenos son los principales esfingolípidos.

Respuesta correcta: 4. Los cerebrósidos y los ganglósidos son esfingolípidos.